有關急性胰臟炎的敘述，下列何者錯誤？
A. 組織學檢查常見脂肪壞死（fat necrosis）
B. 膽結石是急性胰臟炎的常見原因之一
C. 易出現高血鈣症（hypercalcemia）
D. PRSS1 基因突變是造成遺傳性胰臟炎的最常見原因

正確答案：C. 易出現高血鈣症（hypercalcemia）